history of multiple severe hypoglycemic episodes within the last two years

The above is a clinical trial exclusion criterion. Annotated with entity spans:
history of [Multiplier: multiple] [Qualifier: severe] [Condition: hypoglycemic episodes] within the [Temporal: last two years]